Clinical trial exclusion criterion:
Severe hepatic dysfunction (Child-Pugh class C) or severe renal dysfunction (requirement of renal replacement therapy before surgery);

Entity relations:
- Has_value("Child-Pugh", "class C")
- Has_qualifier("hepatic dysfunction", "Severe")
- Subsumes("hepatic dysfunction", "Child-Pugh")
- Has_qualifier("renal dysfunction", "severe")
- Has_index("before surgery", "surgery")
- multi("surgery", "surgery")
- Has_temporal("renal replacement therapy", "before surgery")
- Subsumes("renal dysfunction", "renal replacement therapy")